Clinical trial inclusion criterion:
Women who had regular cycles until at least age 40 and at least one child

Annotated entities:
- Person: "Women"
- Condition: "regular cycles"
- Value: "until at least age 40"
- Person: "age"
- Condition: "who had regular cycles until at least age 40"